下列何者是單一並沒有成對的構造？
A. 脊髓前動脈（anterior spinal artery）與大腦前交通動脈（anterior communicating artery）
B. 脊髓後動脈（posterior spinal artery）與大腦後交通動脈（posterior communicating artery）
C. 脊髓前動脈（anterior spinal artery）與大腦後交通動脈（posterior communicating artery）
D. 脊髓後動脈（posterior spinal artery）與大腦前交通動脈（anterior communicating artery）

正確答案：A. 脊髓前動脈（anterior spinal artery）與大腦前交通動脈（anterior communicating artery）